Clinical trial exclusion criterion:
The participant has received any of the excluded medications or treatments during.

Annotated entities:
- Post-eligibility: "The participant has received any of the excluded medications or treatments during."
- Context_Error: "The participant has received any of the excluded medications or treatments during."